Clinical trial inclusion criterion:
Qualifies for prostaglandin administration according to current Parkland protocol

Entity relations:
- AND("Parkland protocol", "prostaglandin administration")